La clasificación más útil de las vacunas las divide en vivas o atenuadas y vacunas inactivadas. ¿Cuál de las siguientes enfermedades se puede prevenir con una vacuna viva atenuada?
1. Rubeola.
2. Tos ferina.
3. Encefalitis japonesa.
4. Hepatitis B.

Respuesta correcta: 1. Rubeola.